generally healthy grade 1-2 school children

The above is a clinical trial inclusion criterion. Annotated with entity spans:
[Condition: generally healthy] [Observation: grade 1-2 school] [Person: children]